頸椎最容易發生椎間盤退化性病變的位置在：
A. C 3-4
B. C 4-5
C. C 5-6
D. C 6-7

正確答案：C. C 5-6